下列何者不是內頸動脈結紮（Internal carotid artery ligation）的禁忌症（contraindication）？
A. 嚴重低血容症（Severe hypovolemia）
B. 最近有蜘蛛膜下腔出血（Evidence of recent SAH）
C. 腦血管攝影有腦血管痙攣跡象（Evidence of cerebral vasospasm on the arteriogram）
D. 頸動脈顳骨岩部之創傷性動脈瘤剝離（Traumatic dissecting aneurysm of the petrous carotid artery）

正確答案：D. 頸動脈顳骨岩部之創傷性動脈瘤剝離（Traumatic dissecting aneurysm of the petrous carotid artery）